eGFR < 60ml/min/1.73m2

The above is a clinical trial exclusion criterion. Annotated with entity spans:
[Measurement: eGFR] [Value: < 60ml/min/1.73m2]